La prolactina estimula la:
1. Secreción de leche.
2. Eyección láctea.
3. Depósito de grasa en las mamas.
4. Formación de los conductos mamarios.
5. Formación de las células secretoras mamarias.

Respuesta correcta: 1. Secreción de leche.